有關癌細胞常見之基本生理特性，下列敘述何者錯誤？
A. 自發性生長訊息（self-sufficiency in growth signals）
B. DNA修復缺陷及不引發細胞凋亡（defects in DNA repair and evasion of apoptosis）
C. 具侵襲和轉移能力（ability to invade and metastasize）
D. 需大量生長因子（growth factors）

正確答案：D. 需大量生長因子（growth factors）